Chronic administration (defined as more than 14 days) of immunosuppressants or other immune-modifying drugs within six months prior to the first administration of the study vaccine.

The above is a clinical trial exclusion criterion. Annotated with entity spans:
[Qualifier: Chronic] administration (defined as [Temporal: more than 14 days]) of [Drug: immunosuppressants] or [Drug: other immune-modifying drugs] [Temporal: within six months prior] to the first administration of the study vaccine.